Clinical trial exclusion criterion:
active infection

Annotated entities:
- Condition: "active infection"